進行人體試	時，接受試	者同意前，醫療機構應先告知的事項，不包括下列那一事項？
A. 試	目的及方法
B. 可能產生之副作用及危險
C. 預期試	效果
D. 接受試	者撤回同意時，須經主治醫師之同意

正確答案：D. 接受試	者撤回同意時，須經主治醫師之同意